Cuando se dan dos o más episodios depresivos mayores, separados por un periodo de al menos dos meses, durante los cuales el individuo no se deprime ¿qué se diagnostica?
1. Trastorno depresivo mayor.
2. Trastorno distímico.
3. Trastorno ciclotímico.
4. Trastorno depresivo mayor recurrente.
5. Episodio depresivo.

Respuesta correcta: 4. Trastorno depresivo mayor recurrente.